黃太太來門診看家庭醫師林醫師，說上高二的兒子咳嗽、流鼻水2天，想為他拿感冒藥。下列林醫師的那一種作法最恰當？
A. 說明醫師未親自診察不可給病人開藥而拒絕她的請求
B. 向黃太太說明為她兒子的健康及課業	想，此次為他開藥但以後就不可以了
C. 詳細詢問黃太太她兒子有沒有發燒、咳嗽及精神狀況後再做決定
D. 向黃太太說明因孩子沒來，就照上次因感冒來看診的咳嗽及流鼻水藥開給他，若出現發燒或症狀變嚴重要立刻帶他就醫

正確答案：A. 說明醫師未親自診察不可給病人開藥而拒絕她的請求